Hepatitis B surface antigen (HBsAg) positive and <1500 IU/mL.

The above is a clinical trial inclusion criterion. Annotated with entity spans:
[Measurement: Hepatitis B surface antigen] ([Measurement: HBsAg]) [Value: positive] and [Value: <1500 IU/mL].